Clinical trial exclusion criterion:
Patients on neuroleptic drugs in the two months prior to study entry or cognitive behavioural therapy specific to OCD within four weeks of study entry

Entity relations:
- Has_index("in the two months prior to study entry", "study entry")
- Has_temporal("neuroleptic drugs", "in the two months prior to study entry")
- Has_index("within four weeks of study entry", "study entry")
- AND("cognitive behavioural therapy", "OCD")
- Has_temporal("cognitive behavioural therapy", "within four weeks of study entry")
- OR("neuroleptic drugs", "cognitive behavioural therapy")